Clinical trial exclusion criterion:
Treatment with IV antibiotics in the 6 weeks prior to Visit 1

Annotated entities:
- Drug: "IV antibiotics"
- Temporal: "in the 6 weeks prior to Visit 1"
- Reference_point: "Visit 1"